Subjects who the investigator believes that they can and will comply with the requirements of the protocol should be enrolled in the study.

The above is a clinical trial inclusion criterion. Annotated with entity spans:
Subjects who the investigator believes that they [Observation: can and will comply with the requirements of the protocol] should be enrolled in the study.